Clinical trial exclusion criterion:
Moderate or severe COPD exacerbation (requiring corticosteroids or increased dosage of corticosteroids and/or antibiotics or hospitalization) within the 4 weeks prior to Visit 1

Annotated entities:
- Condition: "COPD exacerbation"
- Qualifier: "severe"
- Qualifier: "Moderate"
- Drug: "corticosteroids"
- Drug: "corticosteroids"
- Qualifier: "increased dosage"
- Drug: "antibiotics"
- Visit: "hospitalization"
- Temporal: "within the 4 weeks prior to Visit 1"
- Reference_point: "Visit 1"